Please list the 3 findings in HELLP syndrome.

HELLP syndrome (hemolysis, elevated liver enzymes, low platelets) is an obstetric complication and is characterized by microangiopathic hemolytic anemia, elevated liver enzymes by intravascular breakdown of fibrin in hepatic sinusoids and reduction of platelet circulation by its increased consumption